Clinical trial exclusion criterion:
evident dysfunction of cardia,liver and kidney, or pregnant women or women during lactation

Annotated entities:
- Condition: "dysfunction of cardia"
- Condition: "dysfunction of kidney"
- Condition: "dysfunction of liver"
- Condition: "pregnant"
- Condition: "lactation"